Clinical trial exclusion criterion:
History of violence within 6 months prior to study entry

Annotated entities:
- Temporal: "within 6 months prior"
- Observation: "violence"
- Temporal: "History"